Clinical trial exclusion criterion:
Administration of immunoglobulins and/or any blood products since birth or planned administration during the active phase of the study.

Annotated entities:
- Drug: "immunoglobulins"
- Drug: "any blood products"
- Temporal: "since birth"
- Mood: "planned"
- Temporal: "during the active phase of the study"
- Reference_point: "active phase of the study"
- Reference_point: "birth"